Clinical trial exclusion criterion:
P-glycoprotein (P-gp) inducers (e.g., rifampin, St. John's wort)

Entity relations:
- Subsumes("P-glycoprotein (P-gp) inducers", "rifampin")
- OR("rifampin", "St. John's wort")